下列有關陰囊（scrotum）的敘述，何者正確？
A. 其淺筋膜向下延伸與會陰之深筋膜相連
B. 其淺筋膜為一具有平滑肌之肉膜筋膜（dartos fascia）
C. 其淋巴回流與睪丸相同，均直接流入淺腹股溝淋巴結
D. 前陰囊神經負責絕大部分陰囊之表皮感覺

正確答案：B. 其淺筋膜為一具有平滑肌之肉膜筋膜（dartos fascia）